Clinical trial exclusion criterion:
Chest pain or shortness of breath with activity (such as climbing stairs), peripheral edema, heart palpitations, dry cough, irregular heartbeat, excessive fatigue, unexplained syncope

Annotated entities:
- Condition: "Chest pain"
- Condition: "shortness of breath with activity"
- Condition: "peripheral edema"
- Condition: "heart palpitations"
- Condition: "dry cough"
- Condition: "irregular heartbeat"
- Condition: "excessive fatigue"
- Condition: "syncope"